TBUT > 5 sec. and < 10 sec.

The above is a clinical trial inclusion criterion. Annotated with entity spans:
[Measurement: TBUT] [Value: > 5 sec. and < 10 sec].